7. history of psychosis or other Axis I disorder that is primary;

The above is a clinical trial exclusion criterion. Annotated with entity spans:
[Parsing_Error: 7.] [Temporal: history] of [Condition: psychosis] or other [Condition: Axis I disorder] that is [Qualifier: primary];